Clinical trial exclusion criterion:
Acute coronary syndrome, stroke, transient ischaemic attack, cardiac, carotid, or other major cardiovascular surgery, percutaneous coronary intervention, or carotid angioplasty within the 3 months.

Annotated entities:
- Condition: "Acute coronary syndrome"
- Condition: "stroke"
- Condition: "transient ischaemic attack"
- Condition: "cardiac"
- Condition: "carotid"
- Procedure: "major cardiovascular surgery"
- Procedure: "percutaneous coronary intervention"
- Procedure: "carotid angioplasty"
- Temporal: "within the 3 months"